Clinical trial inclusion criterion:
Patients with reproductive capability must agree to practice adequate contraception methods.

Entity relations:
- Has_qualifier("contraception methods", "adequate")
- AND("reproductive capability", "contraception methods")